Clinical trial exclusion criterion:
Renal insuffuciency

Annotated entities:
- Condition: "Renal insuffuciency"